Clinical trial exclusion criterion:
Discontinuation of proton pump inhibitors, propulsives, antispasmodics, antacids, or bismuth preparations less than 7 days prior to randomization.

Entity relations:
- AND("Discontinuation", "proton pump inhibitors")
- Has_temporal("Discontinuation", "less than 7 days prior to randomization")
- Has_index("less than 7 days prior to randomization", "randomization")
- OR("proton pump inhibitors", "bismuth preparations", "antispasmodics", "propulsives", "antacids")